Any metabolic disorders or other diseases that may impact on normal growth patterns.

The above is a clinical trial exclusion criterion. Annotated with entity spans:
Any [Condition: metabolic disorders] or [Condition: other diseases] that [Qualifier: may impact on normal growth patterns].